Clinical trial exclusion criterion:
History of Acute Myeloid Leukemia (AML) or high risk for AML

Annotated entities:
- Condition: "Acute Myeloid Leukemia"
- Condition: "AML"
- Observation: "risk for AML"
- Qualifier: "high"